Clinical trial inclusion criterion:
History of stable angina pectoris with angiographic evidence of CAD (diameter stenosis = 50%) in major, i.e., left main, left anterior descending, left circumflex, and right coronary arteries.

Entity relations:
- Has_qualifier("CAD", "angiographic evidence")
- Has_multiplier("diameter stenosis", "= 50%")
- Subsumes("major coronary arteries", "left main coronary arteries")
- Has_context("CAD", "diameter stenosis")
- Has_qualifier("CAD", "major coronary arteries")
- OR("left main coronary arteries", "left anterior descending coronary arteries", "left circumflex coronary arteries", "right coronary arteries")